下列那一項構造的胚胎起源與第二對咽弓（pharyngeal arch）無關？
A. 砧骨
B. 莖突
C. 莖突舌骨韌帶
D. 舌骨之小角部

正確答案：A. 砧骨